一般而言，對於 mild gallstone pancreatitis 患者的治療，下列敘述何者錯誤？
A. Fluid and electrolyte repletion 非常重要
B. Antibioitics 是絕對必要
C. Biliary tract 之 definitive treatment 儘可能同一次住院中施行
D. Nutritional support 是必要的

正確答案：B. Antibioitics 是絕對必要